Clinical trial exclusion criterion:
clinically relevant pathologies (eg: pulmonary illness, cardiovascular illness; evolutive cancer, neurological illness, blood illness….)

Entity relations:
- OR("pulmonary illness", "blood illness", "evolutive cancer", "cardiovascular illness", "neurological illness")